Clinical trial inclusion criterion:
Patient may take an inhibitor of proton pump equivalent to 2 times 40 mg of esomeprazole,

Annotated entities:
- Non-representable: "Patient may take an inhibitor of proton pump equivalent to 2 times 40 mg of esomeprazole"